La microscopia más adecuada para identificar Treponema pallidum en exudados de lesiones sifilíticas es la de:
1. Campo claro sin tinción.
2. Campo claro con tinción simple.
3. Campo oscuro.
4. Contraste de fases.
5. Luz polarizada.

Respuesta correcta: 3. Campo oscuro.